Clinical trial exclusion criterion:
acute hip fracture

Entity relations:
- Has_qualifier("hip fracture", "acute")